Clinical trial inclusion criterion:
Platelets >150,000

Entity relations:
- Has_value("Platelets", ">150,000")